Clinical trial inclusion criterion:
Patients who agree to participate in the Trial by signing the Specific Informed Consent of this study.

Annotated entities:
- Informed_consent: "Patients who agree to participate in the Trial by signing the Specific Informed Consent of this study."